有關假產痛（false labor pain）和真產痛（true labor pain）的敘述，下列何者為錯誤？
A. 假產痛通常先由上腹開始疼痛再逐漸痛到下腹，真產痛則通常由下腹開始疼痛
B. 假產痛的疼痛頻率通常不規則，真產痛則通常是規則的疼痛
C. 假產痛子宮頸沒擴張，真產痛子宮頸則會逐漸擴張
D. 假產痛通常會持續數天，真產痛預期一天內小孩會生下來

正確答案：A. 假產痛通常先由上腹開始疼痛再逐漸痛到下腹，真產痛則通常由下腹開始疼痛